高血鈣危機（hypercalcemic crisis）最常見的原因是：
A. 原發性副甲狀腺高能症
B. 惡性腫瘤
C. 維他命 D 中毒
D. 次發性副甲狀腺高能症

正確答案：B. 惡性腫瘤